Inducers of p-glycoprotein

The above is a clinical trial exclusion criterion. Annotated with entity spans:
[Drug: Inducers of p-glycoprotein]